Clinical trial inclusion criterion:
have no serologic evidence of active HBV infection evidenced by negative hepatitis B surface antigen

Entity relations:
- Has_value("hepatitis B surface antigen", "negative")
- AND("serologic evidence of active HBV infection", "HBV infection")
- AND("serologic evidence of active HBV infection", "hepatitis B surface antigen")